TBIL(total bilirubin ), ALT(alanine aminotransferase),AST(glutamic-oxalacetic transaminase) > 2.5×ULN(upper limit of normal); if it were caused by liver metastases, TBIL, ALT,AST >5×ULN.

The above is a clinical trial inclusion criterion. Annotated with entity spans:
[Measurement: TBIL]([Measurement: total bilirubin] ), [Measurement: ALT]([Measurement: alanine aminotransferase]),[Measurement: AST]([Measurement: glutamic-oxalacetic transaminase]) [Value: > 2.5×ULN](upper limit of normal); if it were caused by [Condition: liver metastases], [Measurement: TBIL], [Measurement: ALT],[Measurement: AST] [Value: >5×ULN].